一位 50 歲男性主訴體重減輕，實驗室檢查發現血清白蛋白降低，而上內視鏡檢查發現胃體部皺折 （folds）變粗，則其最適宜之診斷是：
A. 嗜伊紅性胃炎（eosinophilic gastritis）
B. Ménétrier's disease
C. 胃癌（gastric cancer）
D. Zollinger-Ellison syndrome

正確答案：B. Ménétrier's disease